Clinical trial inclusion criterion:
Negative pregnancy test (premenopausal female patient) at screening and use of adequate contraceptive measures (both male and female patients) throughout the study and 30 days after the last cis-UCA dose

Annotated entities:
- Measurement: "pregnancy test"
- Value: "Negative"
- Condition: "premenopausal"
- Person: "female"
- Post-eligibility: "Negative pregnancy test (premenopausal female patient) at screening and use of adequate contraceptive measures (both male and female patients) throughout the study and 30 days after the last cis-UCA dose"